Clinical trial inclusion criterion:
No periodontitis (Community Periodontal Index score = 0).

Annotated entities:
- Negation: "No"
- Condition: "periodontitis"
- Measurement: "Community Periodontal Index score"
- Value: "= 0"